下列何者不是搖頭丸（3,4-methylene-dioxymethamphetamine）引起的症狀？
A. 心跳加速，血壓升高
B. 對感官刺激變得異常敏感，警醒度降低
C. 視覺模糊
D. 會導致情緒不悅，也可能引起妄想或幻覺

正確答案：B. 對感官刺激變得異常敏感，警醒度降低